Clinical trial exclusion criterion:
history of poorly controlled hypertension

Annotated entities:
- Condition: "poorly controlled hypertension"
- Temporal: "history"